下列何者在受精卵中完全源自精子提供？
A. 中心體（centrosomes）
B. 粒線體（mitochondria）
C. 高爾基氏體（Golgi apparatus）
D. 核膜（nuclear envelope）

正確答案：A. 中心體（centrosomes）